Use of anti-dementia medications (Aricept, Exelon, Razadyne) and memantine (Namenda)) or anti-Parkinsonian medications (Sinemet, amantadine, bromocriptine, pergolide, selegeline).

The above is a clinical trial exclusion criterion. Annotated with entity spans:
Use of [Drug: anti-dementia medications] ([Drug: Aricept], [Drug: Exelon], [Drug: Razadyne]) and [Drug: memantine] ([Drug: Namenda])) or [Drug: anti-Parkinsonian medications] ([Drug: Sinemet], [Drug: amantadine], [Drug: bromocriptine], [Drug: pergolide], [Drug: selegeline]).